一位 8 歲女學生被診斷有脊柱側彎，皮膚有咖啡色斑（café-au-lait spots）。全身脊椎 X 光攝影檢查顯示第五至十胸椎側彎 55 度，且椎間神經孔有增大情形。下列何者是最適當的診斷？
A. 先天性脊柱側彎（congenital scoliosis）
B. 特發性脊柱側彎（idiopathic scoliosis）
C. 脊髓膜膨出型脊柱側彎（myelomeningocele scoliosis）
D. 神經纖維瘤脊柱側彎（neurofibromatosis scoliosis）

正確答案：D. 神經纖維瘤脊柱側彎（neurofibromatosis scoliosis）